Clinical trial inclusion criteria:
Has given written informed consent before any study-related activity is performed
Advanced hormone-dependent prostate cancer for which androgen deprivation therapy is indicated, and independently from this trial, Firmagon® is intended to be used for treatment
Age greater than or equal to 18 years and less than 80 years
Advanced hormone-dependent prostate cancer without any other clinically significant disorder
Easten Cooperative Oncology Group score = 2
PSA = 2 ng/mL at screening
Life expectancy of at least 12 months as per the investigator's judgement

Annotated entities:
- Informed_consent: "Has given written informed consent before any study-related activity is performed"
- Qualifier: "hormone-dependent"
- Qualifier: "Advanced"
- Condition: "prostate cancer"
- Procedure: "androgen deprivation therapy"
- Drug: "Firmagon"
- Mood: "intended"
- Person: "Age"
- Value: "greater than or equal to 18 years and less than 80 years"
- Qualifier: "Advanced"
- Qualifier: "hormone-dependent"
- Condition: "prostate cancer"
- Non-query-able: "without any other clinically significant disorder"
- Measurement: "Easten Cooperative Oncology Group score"
- Value: "= 2"
- Measurement: "PSA"
- Value: "= 2 ng/mL"
- Observation: "Life expectancy"
- Value: "at least 12 months"